Clinical trial exclusion criterion:
AST or ALT >2 x upper limit of normal (ULN)

Annotated entities:
- Measurement: "AST"
- Measurement: "ALT"
- Value: ">2 x upper limit of normal (ULN)"